What is the function of the SSX proteins?

transcriptional co-activator